Clinical trial inclusion criterion:
age between 18-80 years old

Annotated entities:
- Person: "age"
- Value: "between 18-80 years"